Clinical trial exclusion criterion:
Has a history of or concurrent congestive heart failure of any grade

Annotated entities:
- Condition: "congestive heart failure"
- Temporal: "concurrent"
- Temporal: "history"